onset of diabetes after age 30

The above is a clinical trial inclusion criterion. Annotated with entity spans:
[Measurement: onset of diabetes] [Value: after age 30]